Clinical trial inclusion criterion:
Has a spectacle cylinder up to 0.75D in each eye.

Annotated entities:
- Device: "spectacle cylinder"
- Value: "up to 0.75D"